Clinical trial exclusion criterion:
cardiac arrhythmias o;

Annotated entities:
- Condition: "cardiac arrhythmias"